What virus is the  Gardisil vaccine used for?

Gardisil, the quadrivalent HPV vaccine would have been useful in the prevention of 28% (13/46) of these infections